Has a potential post-operative pinhole corrected Snellen VA of at least 20/200 or better in both eyes

The above is a clinical trial inclusion criterion. Annotated with entity spans:
Has a potential post-operative [Measurement: pinhole corrected Snellen VA] of [Value: at least 20/200 or better] in [Qualifier: both eyes]